一位 75 歲男性從前未曾有出血傾向，最近三年經常在兩側前臂出現無故瘀青，不久又消失，身體其 他部位沒有此現象。抽血檢查發現血小板數目正常，template bleeding time 正常，PT 和 aPTT 也正常。
 下列診斷何者最可能？
A. Von Willebrand disease
B. Henoch-Schönlein purpura
C. senile purpura
D. uremic bleeding

正確答案：C. senile purpura